Clinical trial inclusion criterion:
Willing to test for HIV

Entity relations:
- Has_mood("test for HIV", "Willing to")